Clinical trial inclusion criterion:
Age equal or superior to 18 years;

Annotated entities:
- Person: "Age"
- Value: "equal or superior to 18 years"